Clinical trial exclusion criterion:
Ongoing treatment with Beta blockers, Diuretic;

Entity relations:
- Has_temporal("treatment", "Ongoing")
- AND("treatment", "Beta blockers")
- OR("Beta blockers", "Diuretic")